Fetal demise

The above is a clinical trial exclusion criterion. Annotated with entity spans:
[Condition: Fetal demise]